Provision of informed consent for participation in the study by patient or surrogate (if the patient is unable to provide informed consent) and caregiver

The above is a clinical trial inclusion criterion. Annotated with entity spans:
[Post-eligibility: Provision of informed consent for participation in the study by patient or surrogate (if the patient is unable to provide informed consent) and caregiver]